2000 年間，臺中清水地區某衛生所通報該地區疑似有群體感染大腸桿菌 O157:H7，O 是指大腸桿菌細胞壁的那一種成分？
A. teichoic acid
B. 內毒素中的 lipid A
C. somatic 抗原
D. 內毒素中的核心（core）多醣體

正確答案：C. somatic 抗原